Clinical trial exclusion criterion:
Any intraocular surgery in the study eye within the last 90 days prior to study enrollment.

Entity relations:
- Has_qualifier("intraocular surgery", "in the study eye")
- Has_temporal("intraocular surgery", "within the last 90 days prior to study enrollment")
- Has_index("within the last 90 days prior to study enrollment", "study enrollment")